Female or male, 20 - 80 years of age

The above is a clinical trial inclusion criterion. Annotated with entity spans:
[Person: Female] or [Person: male], [Value: 20 - 80 years] of [Person: age]